Patients that have a known psychiatric or substance abuse disorder that would interfere with cooperation with the requirements of the trial.

The above is a clinical trial exclusion criterion. Annotated with entity spans:
[Subjective_judgement: Patients that have a known psychiatric or substance abuse disorder that would interfere with cooperation with the requirements of the trial.]